¿Cuál NO es un signo de dificultad respiratoria en el neonato?:
1. Aleteo nasal.
2. Cianosis.
3. Quejido espiratorio.
4. Disociación toraco-abdominal.

Respuesta correcta: 2. Cianosis.